Las células del estómago que se encargan de la secreción de ácido clorhídrico son:
1. Las células principales.
2. Las células G.
3. Las células parietales.
4. Los enterocitos.
5. Los mucositos de superficie.

Respuesta correcta: 3. Las células parietales.